Clinical trial exclusion criterion:
Pregnancy or women currently breastfeeding.

Annotated entities:
- Condition: "Pregnancy"
- Person: "women"
- Observation: "breastfeeding"